Joven de 25 años sin ningún antecedente personal ni familiar de interés, que ingresa en Neurocirugía por fractura craneal por accidente de moto. Tres días después comienza de forma brusca con poliuria, polidipsia y sed intensa tanto diurna como nocturna. En el estudio realizado se objetiva un volumen urinario de 7 litros con osmolaridad urinaria de 190 mOsm/L (90-1200) y osmolaridad plasmática de 292 mOsm/L (275-295). El Na plasmático es 143 mmol/L. Se realiza prueba de restricción hídrica y tras comprobar que no hay aumento en la osmolaridad urinaria, se administra una dosis de 2 microgramos de desmopresina subcutánea. La osmolaridad urinaria posterior es de 410 mOsm/kg. ¿Cuál es el diagnóstico más probable?
1. Polidipsia primaria.
2. Diabetes insípida central.
3. Insuficiencia suprarrenal aguda.
4. SIADH.
5. Diabetes insípida nefrogénica.

Respuesta correcta: 2. Diabetes insípida central.